Patients who have taken either morphine with daily dose more than 120mg or Fentanyl with daily dose more than 50ug/hr

The above is a clinical trial exclusion criterion. Annotated with entity spans:
Patients who have taken either [Drug: morphine] with [Multiplier: daily dose more than 120mg] or [Drug: Fentanyl] with [Multiplier: daily dose more than 50ug/hr]